Clinical trial exclusion criterion:
History of drug/alcohol abuse.

Entity relations:
- Has_temporal("drug/alcohol abuse", "History")